Clinical trial inclusion criterion:
Controlled hypertension: systolic BP < 150 and diastolic BP < 90 mmHg in persons aged 60 years or older, systolic BP < 140 and diastolic BP < 90 mmHg in persons 40 through 59 years according to the JNC 8th guideline

Entity relations:
- Has_qualifier("hypertension", "Controlled")
- Has_qualifier("hypertension", "JNC 8th guideline")
- Has_value("systolic BP", "< 150")
- Has_value("diastolic BP", "< 90 mmHg")
- Has_value("aged", "60 years or older")
- Has_value("systolic BP", "< 140")
- Has_value("diastolic BP", "< 90 mmHg")
- AND("40 through 59", "years")
- Has_value("hypertension", "40 through 59")
- AND("systolic BP", "aged")
- AND("systolic BP", "years")
- AND("diastolic BP", "aged")
- AND("diastolic BP", "years")
- OR("systolic BP", "systolic BP")
- OR("diastolic BP", "systolic BP")